Substance Use Disorder is diagnosed according to DSM-5 criteria.

The above is a clinical trial inclusion criterion. Annotated with entity spans:
[Condition: Substance Use Disorder] is diagnosed according to [Qualifier: DSM-5] criteria.